有關隱睪症（undescended testis）之敘述，下列何者錯誤？
A. 會合併腹股溝疝氣（inguinal hernia）
B. 手術時機應在上小學時
C. 沒有處理的隱睪有發生惡性睪丸腫瘤的機會
D. 沒有處理的隱睪易造成不孕

正確答案：B. 手術時機應在上小學時